Clinical trial exclusion criterion:
Contraindications to general anesthesia

Entity relations:
- AND("Contraindications to general anesthesia", "general anesthesia")